一位25歲愛滋病患，一週前上呼吸道感染，併有膿性鼻涕、鼻塞等鼻竇炎症狀，以及發燒（38℃）、喉嚨 痛，2天前突然畏寒、高燒（39℃）、頭劇痛、眼後痛；理學檢查發現第3、4、6對腦神經麻痺，最可能診斷
 為何？
A. 眼球膿瘍
B. 腦膿瘍
C. 眼球蜂窩組織炎
D. 海綿竇栓塞

正確答案：D. 海綿竇栓塞